下列有關耳蝸（cochlea）之敘述，何者錯誤？
A. 耳蝸內有三個螺旋狀之腔室，包括前庭階（scala vestibuli），中階（scala media）和鼓膜階（scala tympani）
B. 中階又稱耳蝸管（cochlear duct），內含柯蒂氏器（organ of Corti）
C. 中階內之液體成份與細胞外液類似為一低鈉液體，稱為外淋巴液（perilymph）
D. 內淋巴液（endolymph）由血管紋（stria vascularis）所產生，含有高濃度的鉀離子

正確答案：C. 中階內之液體成份與細胞外液類似為一低鈉液體，稱為外淋巴液（perilymph）